Clinical trial exclusion criterion:
severe hypotension, shock, including cardiogenic shock

Entity relations:
- Has_qualifier("hypotension", "severe")
- OR("hypotension", "cardiogenic shock", "shock")